Understand and are willing to comply with the study requirements, including agreeing to be available for the follow-up evaluations

The above is a clinical trial inclusion criterion. Annotated with entity spans:
[Observation: Understand] and are [Observation: willing to comply with the study requirements], including agreeing to be available for the follow-up evaluations